Skin lesions in the area

The above is a clinical trial exclusion criterion. Annotated with entity spans:
[Condition: Skin lesions] in the area